下列疾病在肺功能檢查上皆會表現限制型肺功能障礙，惟何項疾病會增加殘餘量（residual volume）？
A. 肺間質纖維化
B. 肥胖
C. 脊柱後側彎
D. 呼吸肌無力

正確答案：D. 呼吸肌無力